偵測病毒雙股RNA的主要受器為下列何者？
A. Toll-like receptor 3
B. Toll-like receptor 7
C. Toll-like receptor 6
D. Toll-like receptor 4

正確答案：A. Toll-like receptor 3